Clinical trial exclusion criterion:
Use of other investigational drugs 30 days prior to the date of randomization

Annotated entities:
- Drug: "other investigational drugs"
- Temporal: "30 days prior to the date of randomization"